下列何種治療 congestive heart failure 的藥物，其作用機轉是經由阻斷 β-adrenergic receptor 而來的？
A. Metoprolol
B. Valsartan
C. Eplerenone
D. Milrinone

正確答案：A. Metoprolol